Clinical trial exclusion criterion:
Any major urological procedure in the preceding 90 days.

Entity relations:
- Has_temporal("major urological procedure", "preceding 90 days")